Any contradiction to Bisoprolol according to label, including:

The above is a clinical trial exclusion criterion. Annotated with entity spans:
Any [Condition: contradiction] to [Drug: Bisoprolol] according to label, including: